何種類型的心房中膈缺損（atrial septal defect）最常合併部份肺靜脈回流異常（partial abnormal pulmonary  venous return）？
A. primum type
B. secondum type
C. sinus venosus type
D. coronary septal defect type

正確答案：C. sinus venosus type